72 歲陳老太太，罹患糖尿病已 10 年，長期規則服用降血糖藥物，飯前血糖大約控制在 180 mg/dL 左右。近 3 個月來，逐漸出現手掌無力及不靈活，晚上也常因肢體末端灼熱感而無法入睡。下列臨床症狀，那一項最不可能在陳老太太身上出現？
A. 肌腱反射低下
B. 姿勢性低血壓（orthostatic hypotension）
C. 手掌肌肉萎縮
D. Babinski sign 呈現大腳趾背伸反應（dorsiflexion response）

正確答案：D. Babinski sign 呈現大腳趾背伸反應（dorsiflexion response）